Clinical trial exclusion criterion:
Glaucoma;

Annotated entities:
- Condition: "Glaucoma"